Clinical trial exclusion criterion:
Augmentation of labor (latent or active phase)

Annotated entities:
- Condition: "Augmentation of labor"
- Qualifier: "latent phase"
- Qualifier: "active phase"